Caucasian or Non-Caucasian

The above is a clinical trial inclusion criterion. Annotated with entity spans:
[Person: Caucasian] or [Person: Non-Caucasian]